6. Can understand and sign written informed consent, or will have a parent or a legally authorized representative (LAR) who can do so, prior to the performance of any study assessments.

The above is a clinical trial inclusion criterion. Annotated with entity spans:
[Parsing_Error: 6.] [Post-eligibility: Can understand and sign written informed consent, or will have a parent or a legally authorized representative (LAR) who can do so, prior to the performance of any study assessments.]